Clinical trial exclusion criterion:
Have had recent ST elevation myocardial infarction or non-ST elevation MI (< 30 days); note that biomarker elevation alone after ventricular arrhythmias does not denote MI.

Annotated entities:
- Condition: "ST elevation myocardial infarction"
- Condition: "non-ST elevation MI"
- Temporal: "< 30 days"
- Non-query-able: "ote that biomarker elevation alone after ventricular arrhythmias does not denote MI"